What is the mode of action of filgotinib?

Filgotinib is an oral selective JAK inhibitor. It works by inhibiting JAK1.